Clinical trial inclusion criterion:
High blood pressure (=130 mmHg systolic or =85mmHg diastolic), or on medication for treating the condition

Entity relations:
- Subsumes("High blood pressure", "blood pressure")
- Subsumes("High", "=130 mmHg systolic")
- AND("medication for treating", "High blood pressure")
- multi("blood pressure", "High blood pressure")
- OR("=130 mmHg systolic", "=85mmHg diastolic")